Age >= 65 years, < 90 years;

The above is a clinical trial inclusion criterion. Annotated with entity spans:
[Person: Age] [Value: >= 65 years, < 90 years];